Clinical trial exclusion criterion:
Patients who cannot give informed consent,

Annotated entities:
- Non-query-able: "Patients who cannot give informed consent,"